Which transcription factors are known as the four (4) "Yamanaka factors" that have been used to create induced pluripotent stem cells  (iPSCs)?

Fibroblasts can be reprogrammed into induced pluripotent stem cells (iPSCs) by the application of Yamanaka factors (OSKM). In particular, the mechanisms how the Yamanaka factors (Oct4, Sox2, Klf4, and c-Myc) directly drive reprogramming and which additional components are involved are still not yet understood.